Organ transplant patients

The above is a clinical trial inclusion criterion. Annotated with entity spans:
[Procedure: Organ transplant] patients